Currently prescribed medication with anti-epileptic activity (keppra, dilantin, tegretol, lamictal, topamax, etc.)

The above is a clinical trial exclusion criterion. Annotated with entity spans:
Currently prescribed [Drug: medication] with [Qualifier: anti-epileptic activity] ([Drug: keppra], [Drug: dilantin], [Drug: tegretol], [Drug: lamictal], [Drug: topamax], etc.)